Clinical trial exclusion criterion:
Chronic neurological lesion

Annotated entities:
- Condition: "Chronic neurological lesion"